Clinical trial inclusion criterion:
Implanted Fineline-II-leads (BSCI), MRI conditional

Entity relations:
- Subsumes("Implanted Fineline-II-leads", "BSCI")
- Has_qualifier("Implanted Fineline-II-leads", "MRI conditional")